下列有關 Langerhans 細胞的敘述，何者正確？
A. 是內分泌細胞
B. 是表皮的樹突（dendritic）細胞
C. 出現於結核結節
D. 是黑色素細胞的前身

正確答案：B. 是表皮的樹突（dendritic）細胞